Clinical trial inclusion criterion:
Symptoms of COPD: Subjects must score 2 or higher on the modified Medical Research Council Dyspnea scale (Visit 1)

Annotated entities:
- Condition: "Symptoms of COPD"
- Value: "score 2 or higher"
- Measurement: "modified Medical Research Council Dyspnea scale"